下列何者止於內側脛骨髁（medial tibial condyle）？
A. 股薄肌（gracilis）
B. 半膜肌（semimembranosus）
C. 半腱肌（semitendinosus）
D. 縫匠肌（sartorius）

正確答案：B. 半膜肌（semimembranosus）